Clinical trial inclusion criterion:
Ride home from dilator insertion clinic appointment

Entity relations:
- AND("Ride home", "dilator insertion")